Subject has a life expectancy of = 1 year.

The above is a clinical trial exclusion criterion. Annotated with entity spans:
Subject has a [Observation: life expectancy] of [Value: = 1 year].